β-lactamase inhibitor 在臨床上常與下列 penicillin 類藥物搭配合用，來擴充其抗菌範圍和活性，何項除外？
A. nafcillin
B. ampicillin
C. amoxicillin
D. ticarcillin

正確答案：A. nafcillin